Clinical trial inclusion criterion:
regular bowel care routine (at least four weeks)

Entity relations:
- Has_temporal("regular bowel care routine", "at least four weeks")